12歲男童，出生體重、身長及一歲前生長發育均正常，身體診察發現身高低於正常平均值，骨齡比實際年齡小，抽血檢查發現生長因子（IGF-1）低於年齡正常值但與骨齡相吻合，下列何者正確？
A. IGF-1缺乏症（IGF-1 deficiency）
B. 生長激素缺乏症（growth hormone deficiency）
C. 甲狀腺功能低下（hypothyroidism）
D. 體質遲緩（constitutional growth delay）

正確答案：D. 體質遲緩（constitutional growth delay）